Clinical trial exclusion criterion:
Use and unwillingness to stop use of other forms of nicotine such as cigars, pipes, or chewing tobacco

Annotated entities:
- Post-eligibility: "Use and unwillingness to stop use of other forms of nicotine such as cigars, pipes, or chewing tobacco"